History of decreased LVEF or symptomatic congestive heart failure (CHF) with previous adjuvant trastuzumab treatment.

The above is a clinical trial exclusion criterion. Annotated with entity spans:
[Temporal: History] of [Value: decreased] [Measurement: LVEF] or [Qualifier: symptomatic] [Condition: congestive heart failure (CHF)] with [Temporal: previous] [Qualifier: adjuvant] [Drug: trastuzumab] treatment.